下列那一個基因的突變與甲狀腺髓質癌（medullary carcinoma）的形成最有關係？
A. RAS
B. RET
C. BRAF
D. PTEN

正確答案：B. RET